下列有關炎性腸病（inflammatory bowel disease）的敘述，何者錯誤？
A. 潰瘍性大腸炎（ulcerative colitis, UC），只侵犯大腸；克隆氏病（Crohn's disease, CD），從口腔到肛門都可能侵犯
B. UC 為廣泛性黏膜發炎；CD 呈斑塊性深層發炎，可能形成膿瘍、瘻管
C. UC 及 CD 皆有癌變之可能，尤其患病 8 年以上時為然
D. 抽菸在 CD 病人有利於減輕症狀，但停抽時反會惡化；但對 UC 病人則只會使症狀惡化

正確答案：D. 抽菸在 CD 病人有利於減輕症狀，但停抽時反會惡化；但對 UC 病人則只會使症狀惡化